with centre neural system involvement

The above is a clinical trial exclusion criterion. Annotated with entity spans:
with [Condition: centre neural system involvement]